Exclusions Related to Pulmonary Disease

The above is a clinical trial exclusion criterion. Annotated with entity spans:
[Parsing_Error: Exclusions Related to Pulmonary Disease]